Señale la afirmación correcta acerca del programa de entrenamiento para padres creado por Barkley:
1. Su principal objetivo es mejorar las habilidades sociales y comunicativas de los hijos.
2. Su principal objetivo es mejoras las habilidades de autocontrol de los hijos.
3. Prohíbe el uso de cualquier tipo de castigo, incluyendo el tiempo fuera.
4. Uno de sus objetivos es disminuir los conflictos que puedan surgir en el contexto escolar.
5. Se realizan sesiones con los hijos de forma paralela a las de los padres.

Respuesta correcta: 4. Uno de sus objetivos es disminuir los conflictos que puedan surgir en el contexto escolar.